Clinical trial exclusion criterion:
under 18 or over 50 years of age

Annotated entities:
- Value: "under 18 or over 50 years"
- Person: "age"